Clinical trial exclusion criterion:
People with any open or bleeding wounds at any sensor plate contact surface location

Entity relations:
- Has_qualifier("open wounds", "at any sensor plate contact surface location")
- Has_qualifier("bleeding wounds", "at any sensor plate contact surface location")
- OR("open wounds", "bleeding wounds")